20歲女性，發現右側乳房外上方有一個2公分大小，界限明顯且能移動的腫瘤。下列何者是最可能的診斷？
A. 慢性乳房炎（chronic mastitis）
B. 纖維腺瘤（fibroadenoma）
C. 管內乳突瘤（intraductal papilloma）
D. 侵襲性管腺癌（invasive ductal carcinoma）

正確答案：B. 纖維腺瘤（fibroadenoma）